Clinical trial exclusion criterion:
Known thrombocytopenia, contraindicating intramuscular vaccination

Entity relations:
- AND("contraindicating", "intramuscular vaccination")
- Subsumes("thrombocytopenia", "contraindicating")